Clinical trial inclusion criterion:
Karnofsky Performance Status > 60

Annotated entities:
- Measurement: "Karnofsky Performance Status"
- Value: "> 60"